Las personas afectadas de insuficiencia cardiaca crónica suelen presentar el diagnóstico de enfermería Intolerancia a la actividad relacionado con:
1. Miedo, por ser una situación que supone un riesgo potencial para la vida.
2. Desequilibrio entre el aporte y la demanda de oxígeno debido a la disminución de la contractilidad del miocardio.
3. Exceso de volumen de líquidos por interrupción del flujo sanguíneo.
4. Conocimientos deficientes respecto a la enfermedad y el tratamiento con diuréticos.
5. Infección por respuesta inmunitaria disminuida.

Respuesta correcta: 2. Desequilibrio entre el aporte y la demanda de oxígeno debido a la disminución de la contractilidad del miocardio.